What is MACE in the context of cardiotoxicity?

major adverse cardiac events (MACE)